Life expectancy less than 6 months

The above is a clinical trial exclusion criterion. Annotated with entity spans:
[Observation: Life expectancy] [Value: less than 6 months]